Which epigenetic mark is deposited by PRC2?

The Polycomb Repressive Complex 2 (PRC2) has been identified as a key regulator of epigenetic mark H3K27me3.